What type of sequences do enhancers evolve from?

Most of the recently evolved enhancers arise from ancestral DNA exaptation, rather than lineage-specific expansions of repeat elements. The sequences of some gene regulatory elements diverge considerably, even between closely related species.